下列有關肺癌轉移到股骨近端，並引起轉子間部位病理性骨折時的敘述，何者正確？
A. 通常為高能量創傷所造成
B. 經常引起骨骼增生變化
C. 應施行手術置換人工髖關節治療
D. 須施行輻射治療和手術治療

正確答案：D. 須施行輻射治療和手術治療